下列何者的起始點（origin）不在肱骨？
A. 喙肱肌（coracobrachialis）
B. 肱肌（brachialis）
C. 肱橈肌（brachioradialis）
D. 掌長肌（palmaris longus）

正確答案：A. 喙肱肌（coracobrachialis）